一位40歲男性患有肢端肥大的症狀，放射學診斷發現有腦下垂體腫瘤，除了外科手術切除腫瘤外。下列何者可以被用來治療此種疾病？
A. desmopressin
B. octreotide
C. leuprolide
D. somatropin

正確答案：B. octreotide